capability of understanding the investigational nature, potential risks and benefits of the clinical trial

The above is a clinical trial inclusion criterion. Annotated with entity spans:
[Post-eligibility: capability of understanding the investigational nature, potential risks and benefits of the clinical trial]